How many of the human PML isoforms are cytosolic?

Using a system in which only a single EYFP-linked PML isoform is expressed, PMLI, PMLII and PMLVI accumulate in the cytoplasm following arsenic treatment, whereas PMLIII, PMLIV and PMLV do not